Before 2019, what neurologic diseases are associated with the tau protein?

Tau proteins are involved in the pathogenesis of multiple sclerosis and amyotrophic lateral sclerosis.